Clinical trial inclusion criterion:
Established diagnosis of UC and moderate-to-severe disease activity, defined as a Mayo score of 6-12, with an endoscopic subscore =2.

Annotated entities:
- Condition: "UC"
- Qualifier: "moderate-to-severe"
- Measurement: "Mayo score"
- Value: "6-12"
- Measurement: "endoscopic subscore"
- Value: "=2"